Clinical trial exclusion criteria:
Subjects with topical and/or systemic medication or mechanical devices that interfere determinedly on the results of the study (such as topical immunomodulators, punctal plugs, corticosteroids, preservative artificial tears, contact lenses).
Subjects (females) with active sexual life that do not use a contraceptive method.
Female subjects who are pregnant or lactating
Female subjects with a positive urine pregnancy test
Positive drug addictions* (verbal interrogatory)
Subjects who have participated on any other research clinical trials on the last 40 days
Subjects legal or mentally disabled to give an informed consent for participating on this study
Subjects who can't comply with the appointments or with every protocol requirement.
Serious tear film dysfunction syndrome TBUT < 5 s Schirmer: < 4 mm OSDI > 30 pints Corneal staining > grade III on the Oxford scale
Non perforated corneal ulcer
Perforated corneal ulcer
Autoimmune corneal ulcer
Ocular surface scarring diseases
Ocular surface or annexes metaplastic lesions
Fibro vascular proliferation lesions on the conjunctival and/or corneal surface (i.e.: pterygium)
Concomitant chronic inflammatory diseases on any ocular structure
Acute or infectious inflammatory disease
Corneal disease potentially requiring a treatment during the following 3 months
Use of topical or systemic drug products classified as forbidden
Ocular surgical procedures 3 months before the protocol inclusion
Treatments or procedures indicated on the tear film dysfunction treatment, as punctal silicone plugs.
Posterior segment diseases requiring a treatment or threatening the visual prognosis
Retinal diseases potentially requiring treatment during the following 3 months
History of penetrating keratoplasty.
Soft or hard contact lenses use during the last month from inclusion day

Annotated entities:
- Drug: "systemic medication"
- Drug: "topical medication"
- Device: "mechanical devices"
- Drug: "topical immunomodulators"
- Device: "punctal plugs"
- Drug: "corticosteroids"
- Drug: "preservative artificial tears"
- Device: "contact lenses"
- Person: "females"
- Observation: "active sexual life"
- Negation: "not"
- Procedure: "contraceptive method"
- Person: "Female"
- Condition: "pregnant"
- Condition: "lactating"
- Person: "Female"
- Value: "positive"
- Measurement: "urine pregnancy test"
- Condition: "Positive drug addictions"
- Procedure: "verbal interrogatory"
- Competing_trial: "Subjects who have participated on any other research clinical trials on the last 40 days"
- Condition: "mentally disabled"
- Condition: "legal disabled"
- Informed_consent: "Subjects legal or mentally disabled to give an informed consent for participating on this study"
- Non-query-able: "Subjects who can't comply with the appointments or with every protocol requirement."
- Condition: "Serious tear film dysfunction syndrome"
- Measurement: "TBUT"
- Line: "Serious tear film dysfunction syndrome"
- Value: "< 5 s"
- Measurement: "Schirmer"
- Value: "< 4 mm"
- Measurement: "OSDI"
- Value: "> 30 pints"
- Measurement: "Corneal staining"
- Value: "> grade III"
- Qualifier: "Oxford scale"
- Line: "TBUT < 5 s"
- Line: "Schirmer: < 4 mm"
- Line: "OSDI > 30 pints"
- Line: "Corneal staining > grade III on the Oxford scale"
- Qualifier: "Non perforated"
- Condition: "corneal ulcer"
- Condition: "corneal ulcer"
- Qualifier: "Perforated"
- Condition: "corneal ulcer"
- Qualifier: "Autoimmune"
- Condition: "Ocular surface scarring diseases"
- Condition: "lesions Ocular surface"
- Condition: "annexes metaplastic lesions Ocular"
- Condition: "Fibro vascular proliferation lesions"
- Qualifier: "corneal surface"
- Qualifier: "conjunctival"
- Qualifier: "pterygium"
- Temporal: "Concomitant"
- Condition: "chronic inflammatory diseases"
- Qualifier: "ocular structure"
- Condition: "inflammatory disease"
- Qualifier: "Acute"
- Qualifier: "infectious"
- Condition: "Corneal disease"
- Procedure: "treatment"
- Mood: "potentially requiring"
- Temporal: "during the following 3 months"
- Non-representable: "Use of topical or systemic drug products classified as forbidden"
- Procedure: "Ocular surgical procedures"
- Temporal: "3 months before the protocol inclusion"
- Reference_point: "protocol inclusion"
- Temporal: "3 months before the protocol inclusion"
- Procedure: "Treatments"
- Procedure: "procedures"
- Procedure: "tear film dysfunction treatment"
- Device: "punctal silicone plugs"
- Condition: "Posterior segment diseases"
- Procedure: "treatment"
- Condition: "threatening the visual prognosis"
- Mood: "requiring"
- Temporal: "during the following 3 months"
- Procedure: "treatment"
- Mood: "requiring"
- Condition: "Retinal diseases"
- Procedure: "penetrating keratoplasty"
- Temporal: "History"
- Device: "hard contact lenses"
- Device: "Soft contact lenses"
- Temporal: "during the last month from inclusion day"
- Reference_point: "inclusion day"